Clinical trial exclusion criterion:
Allergy/hypersensitivity to acetaminophen

Entity relations:
- AND("Allergy", "acetaminophen")
- OR("Allergy", "hypersensitivity")